Clinical trial exclusion criterion:
Liver disease caused by an etiology other than HCV

Annotated entities:
- Condition: "Liver disease"
- Negation: "other"
- Observation: "HCV"